Which mutated gene is associated with Waardenburg and Tietz syndromes?

Mutations in microphthalmia-associated transcription factor (MITF) gene cause Waardenburg and Tietz syndromes.